Clinical trial exclusion criterion:
Patient with a chronic pain condition, major unexpected surgical complication, unexpected prolonged intubation, patient refusal, local anesthetic allergy, any contraindication to regional anesthesia, greater than 2 attempts by resident and greater than 1 attempt by staff anesthesiologist for TAP block.

Entity relations:
- Has_qualifier("unexpected surgical complication", "major")
- Has_multiplier("intubation", "prolonged")
- Has_qualifier("intubation", "unexpected")
- AND("allergy", "local anesthetic")
- AND("contraindication", "regional anesthesia")
- Has_multiplier("resident", "greater than 2")
- Has_multiplier("anesthesiologist", "greater than 1")
- AND("TAP block", "resident")
- AND("TAP block", "anesthesiologist")
- OR("chronic pain condition", "unexpected surgical complication", "intubation", "patient refusal", "allergy", "contraindication", "TAP block")